Other significant medical conditions that could increase the risk to the subject.

The above is a clinical trial exclusion criterion. Annotated with entity spans:
[Non-query-able: Other significant medical conditions that could increase the risk to the subject].